El “tiempo de Inspección” (TI) puede considerarse, más propiamente, una medida de:
1. La eficiencia neural.
2. La memoria.
3. El neuroticismo.
4. La dependencia /independencia de campo.

Respuesta correcta: 1. La eficiencia neural.